人類經由肛門所排出的「氣」（Flatus），大約有多少比例是由大腸內細菌的發酵（Fermentation）所產生的？
A. 百分之二十五
B. 百分之五十
C. 百分之七十五
D. 百分之百

正確答案：C. 百分之七十五